某一高科技業者因家庭教育的關係，很少清洗肚臍，一日因肚皮奇癢難耐，並發現肚臍鑽出似蛆之小蟲，請問有關此病例之敘述，下列何者錯誤？
A. 此病人應是罹患蠅蛆症（myiasis）
B. 蠅蛆症之發生，一定是母蠅產卵於患者之傷口，因此本病人之肚臍已有病灶（lesion）
C. 蠅蛆症不只在皮膚病灶，腸道或生殖泌尿道也可能發生
D. 本病人之治療應清創和移除所有蠅蛆，並視情況給予適當抗生素治療，以防二次感染（secondary infection）

正確答案：B. 蠅蛆症之發生，一定是母蠅產卵於患者之傷口，因此本病人之肚臍已有病灶（lesion）